馮科⻑45歲，體型微胖，半年多前開始有無故突然的胸痛發作。看了多間醫學中心的心、肺等專科，做了各種健保及自費檢查，都找不出器質性原因。雖然醫師一再保證心臟病的可能很少，馮先生依然擔心仍有隱伏 的身體問題未找出來，繼續不斷尋找各種醫療與檢查。根據精神疾病診斷與統計手冊第五版（DSM-V），最可能的診斷是？
A. 重度憂鬱症（major depression）
B. 輕鬱性情感障礙症（dysthymic disorder）
C. 身體症狀障礙症（somatic symptom disorder）
D. 焦慮症（anxiety disorder）

正確答案：C. 身體症狀障礙症（somatic symptom disorder）